La reacción de un derivado halogenado con trifenilfosfina conduce a una sal de:
1. Sulfonio.
2. Diazonio.
3. Amonio.
4. Piridinio.
5. Fosfonio.

Respuesta correcta: 5. Fosfonio.